History of a solitary renal transplant

The above is a clinical trial inclusion criterion. Annotated with entity spans:
History of a [Qualifier: solitary] [Procedure: renal transplant]